慢性肛裂的外科療法，應採行下列何者？
A. anal stretch procedure
B. partial lateral external sphincterotomy
C. partial lateral internal sphincterotomy
D. excision of fissure with primary suture

正確答案：C. partial lateral internal sphincterotomy